有關人格違常者的行為模式之敘述，下列何者錯誤？
A. 與文化背景所預期的甚遠，在認知、情感、人際關係、衝動控制尚有明顯的適應不良
B. 存在於廣泛的個人或社會情境中
C. 造成內心的顯著痛苦，或損害社會、職業等功能
D. 是突發性的，且發生於中老年時期

正確答案：D. 是突發性的，且發生於中老年時期